History of intolerance to LMWHs during HD

The above is a clinical trial exclusion criterion. Annotated with entity spans:
History of [Condition: intolerance] to [Drug: LMWHs] [Temporal: during HD]